¿Cuál es, según la Teoría de la Acción Razonada, el determinante inmediato de una conducta de salud?:
1. La vulnerabilidad percibida.
2. Los costes percibidos.
3. Las creencias de salud.
4. La intención de realizar la conducta.

Respuesta correcta: 4. La intención de realizar la conducta.